El cociente entre el número de nacidos vivos registrado en un año y la población femenina en edad de procrear (15-49 años) se refiere al concepto de:
1. Tasa bruta de natalidad.
2. Tasa general de fecundidad.
3. Índice sintético de fecundidad.
4. Tasa bruta de reproducción.
5. Tasa neta de reproducción.

Respuesta correcta: 2. Tasa general de fecundidad.